關於肩關節脫臼及不穩定（shoulder dislocation and instability），下列敘述何者錯誤？
A. 前向脫臼（anterior dislocation）比後向脫臼（posterior dislocation）常見
B. 在前向脫臼（anterior dislocation）中，須注意可能併發神經損傷，其中以橈神經（radial nerve）損傷最為常見
C. 若第一次發生脫臼的年齡小於 20 歲，則日後有較高的機會發生再發性脫臼（recurrent dislocation）
D. 肩關節若有多重方向性不穩定（multidirectional instability），通常不是由創傷造成，治療時以物理治療為優先選擇

正確答案：B. 在前向脫臼（anterior dislocation）中，須注意可能併發神經損傷，其中以橈神經（radial nerve）損傷最為常見